Which syndrome is associated with OATP1B1 and OATP1B3 deficiency?

Complete and simultaneous deficiency of the organic anion transporting polypeptides OATP1B1 and OATP1B3 due to mutations in their corresponding genes, has been linked to Rotor syndrome.